Clinical trial exclusion criterion:
HIV positivity

Entity relations:
- Has_value("HIV", "positivity")
- multi("HIV positivity", "HIV")